Clinical trial inclusion criterion:
Weight: more than 40 Kg

Entity relations:
- Has_value("Weight", "more than 40 Kg")